一位 25 歲男子休假赴東南亞旅行，為了節省費用，吃住均找價錢最低廉者，回國後 2 星期出現發燒、噁心、腹部疼痛、沒有食慾及感到疲勞等症狀，雖然去看了醫生並服了藥，4 天後仍發生黃疸的現象，此男子可能得了什麼疾病？
A. 黃熱病
B. 肝炎
C. 登革熱
D. 腸胃炎

正確答案：B. 肝炎